Clinical trial inclusion criterion:
the subjects have completed the basic immunization of 2 needle recombinant hepatitis B vaccine, there is no inoculation history of EV71 vaccine, and no history of EV71 infection

Annotated entities:
- Multiplier: "2"
- Drug: "needle recombinant hepatitis B vaccine"
- Negation: "no"
- Drug: "EV71 vaccine"
- Negation: "no"
- Temporal: "history"
- Condition: "EV71 infection"
- Procedure: "inoculation"
- Temporal: "history"